下列疾病中，何者不會有肌肉束顫（fasciculations）？
A. amyotrophic lateral sclerosis
B. progressive spinal muscular atrophy
C. hypokalemic periodic paralysis
D. radiculopathies

正確答案：C. hypokalemic periodic paralysis